¿Qué tipo de expectativas incluye el modelo cognitivo de Reiss para la explicación de las fobias?:
1. Expectativas de ansiedad y expectativas de preocupación.
2. Expectativas de daño y expectativas de peligro.
3. Expectativas de ansiedad y expectativas de peligro.
4. Expectativas de ansiedad y expectativas de asco.

Respuesta correcta: 3. Expectativas de ansiedad y expectativas de peligro.